En cuanto a la exploración del desarrollo psicomotor, del área del lenguaje y de la sociabilidad en un niño de cuatro años ¿cuál de los siguientes hallazgos se puede considerar un signo de alarma en el proceso de maduración?:
1. Detención brusca de la adquisición de habilidades o pérdida de algunas ya adquiridas.
2. Hiperactividad. No sabe entretenerse solo, necesita vigilancia continua.
3. Excesiva sociabilidad; se marcha con cualquiera de manera indiscriminada.
4. Repite preguntas en lugar de responderlas.
5. Todas estas situaciones son signos de alarma.

Respuesta correcta: 5. Todas estas situaciones son signos de alarma.